renal failure

The above is a clinical trial exclusion criterion. Annotated with entity spans:
[Condition: renal failure]